Clinical trial exclusion criterion:
Patients with known hypersensitivity to any of the drugs used in this study.

Entity relations:
- AND("hypersensitivity", "drugs used in this study")